Participants with a blood pressure in the 95th percentile or greater for age, sex, and height on 2 separate readings recorded on 2 separate days. Those participants who had uncontrolled hypertension at Screening can be rescreened more than 1 month after initiation or adjustment of antihypertensive therapy 1 time.

The above is a clinical trial exclusion criterion. Annotated with entity spans:
Participants with a [Measurement: blood pressure] in the [Value: 95th percentile or greater] [Qualifier: for age], sex, and height on [Multiplier: 2 separate readings] recorded on [Qualifier: 2 separate days]. [Non-representable: Those participants who had uncontrolled hypertension at Screening can be rescreened more than 1 month after initiation or adjustment of antihypertensive therapy 1 time.]